Clinical trial exclusion criterion:
Hypertension (high blood pressure) that can not be controlled by drugs;

Entity relations:
- Subsumes("Hypertension", "high blood pressure")
- multi("controlled by drugs", "drugs")
- Has_qualifier("Hypertension", "controlled by drugs")
- Has_negation("controlled by drugs", "not")